Clinical trial exclusion criterion:
Subjects not able to give informed consent

Entity relations:
- Has_mood("give informed consent", "able to")
- Has_negation("give informed consent", "not")